慢性骨髓性白血病的治療藥物中，何者讓費城染色體消失的效果最好？
A. Imatinib
B. α-interferon
C. Cytosine arabinoside
D. Hydroxyurea

正確答案：A. Imatinib